Clinical trial inclusion criterion:
Histologically proven recurrent or persistent squamous cell carcinoma, adenosquamous carcinoma, or adenocarcinoma of the cervix that is not amenable to curative treatment with surgery and/or radiation therapy AND has failed 2 previous treatment regimens.

Entity relations:
- Has_value("Histologically", "proven")
- Has_negation("amenable to curative treatment", "not")
- AND("2", "treatment regimens")
- Has_temporal("treatment regimens", "previous")
- Has_qualifier("squamous cell carcinoma", "recurrent")
- AND("squamous cell carcinoma", "Histologically")
- Has_qualifier("squamous cell carcinoma", "amenable to curative treatment")
- AND("amenable to curative treatment", "surgery")
- AND("treatment regimens", "squamous cell carcinoma")
- AND("squamous cell carcinoma", "adenosquamous carcinoma")
- AND("adenosquamous carcinoma", "adenocarcinoma of the cervix")
- AND("adenosquamous carcinoma", "Histologically")
- AND("adenocarcinoma of the cervix", "Histologically")
- Has_qualifier("adenosquamous carcinoma", "amenable to curative treatment")
- Has_qualifier("adenocarcinoma of the cervix", "amenable to curative treatment")
- AND("treatment regimens", "adenosquamous carcinoma")
- AND("treatment regimens", "adenocarcinoma of the cervix")
- OR("recurrent", "persistent")
- OR("surgery", "radiation therapy")